Clinical trial exclusion criterion:
Acute ST-segment-elevation myocardial infarction (STEMI)

Entity relations:
- Subsumes("Acute ST-segment-elevation myocardial infarction", "STEMI")